Clinical trial exclusion criterion:
Unable to give informed consent in English

Annotated entities:
- Post-eligibility: "Unable to give informed consent in English"